Clinical trial exclusion criterion:
Treatment with psychotropic medications in the 2 weeks prior to randomization with the exception of approved treatments for dementia (ChEIs and memantine), selective serotonin reuptake inhibitor antidepressants, and trazodone (if used as an aid to facilitate sleep and not as an antidepressant); other psychotropics (with the exclusion of antipsychotics), if stable for 3 months, may be allowed only with Steering Committee approval on a case by case basis. Note that antipsychotics are expressly prohibited.

Entity relations:
- Has_index("in the 2 weeks prior to randomization", "randomization")
- AND("treatments for dementia", "dementia")
- AND("treatments for dementia", "ChEIs")
- Has_temporal("psychotropic medications", "in the 2 weeks prior to randomization")
- Has_negation("treatments for dementia", "with the exception of")
- AND("psychotropic medications", "treatments for dementia")
- Has_negation("antipsychotics", "with the exclusion of")
- AND("other psychotropics", "antipsychotics")
- Has_temporal("stable", "for 3 months")
- Has_qualifier("other psychotropics", "stable")
- AND("treatments for dementia", "memantine")
- OR("treatments for dementia", "selective serotonin reuptake inhibitor antidepressants", "trazodone")
- OR("psychotropic medications", "other psychotropics")